Refractory to conservative treatment

The above is a clinical trial inclusion criterion. Annotated with entity spans:
[Qualifier: Refractory] to [Procedure: conservative treatment]